Any metabolic disease bone disease that has not been stabilized for at least three months (e.g., Paget's disease, osteomalacia, osteogenesis imperfecta, thyroid and/or parathyroid gland disorder, etc.).

The above is a clinical trial exclusion criterion. Annotated with entity spans:
Any [Condition: metabolic disease] [Condition: bone disease] that has [Negation: not] [Observation: been stabilized] [Temporal: for at least three months] (e.g., [Condition: Paget's disease], [Condition: osteomalacia], [Condition: osteogenesis imperfecta], [Condition: thyroid] and/or [Condition: parathyroid gland disorder], etc.).